Having experienced severe allergies, trauma history and/or operation history within 3 months;

The above is a clinical trial exclusion criterion. Annotated with entity spans:
Having experienced [Condition: severe allergies], [Condition: trauma] history and/or [Procedure: operation] history [Temporal: within 3 months];